奇數碳的脂肪酸經過β-oxidation後，最後產生的三碳產物會以何種形式直接進入檸檬酸循環（citric acid  cycle）？
A. α-ketoglutarate
B. succinyl-CoA
C. oxaloacetate
D. propionyl-CoA

正確答案：B. succinyl-CoA